En un paciente con sepsis y coagulopatía de consumo, ¿cuál de las siguientes pruebas analíticas indicarían un estado de hiperfibrinolisis?:
1. Alargamiento tiempo de protrombina.
2. Déficit de antitrombina.
3. Aumento de Dimero D.
4. Aumento de proteína C.
5. Aumento de PAI-1.

Respuesta correcta: 3. Aumento de Dimero D.